Which protein is encoded by the protein APOBEC3C?

The gene APOBEC3C codes for: apolipoprotein B mRNA editing enzyme catalytic polypeptide-like 3C